Clinical trial exclusion criterion:
Previous low response (less than 3 oocytes on a high dose of FSH stimulation)

Annotated entities:
- Condition: "low response"
- Temporal: "Previous"
- Measurement: "oocytes"
- Value: "less than 3"
- Procedure: "high dose of FSH stimulation"